Severe coagulopathy

The above is a clinical trial inclusion criterion. Annotated with entity spans:
[Qualifier: Severe] [Condition: coagulopathy]